Current use of standard antidepressant treatment in monotherapy or combination of 2 antidepressants : escitalopram (10 - 20mg/d), fluoxetine(20 - 40mg/d), paroxetine CR(25 - 50mg/d), sertraline(100 - 150mg/d), mirtazapine (15 - 45mg/d), duloxetine (30 - 60mg/d) or venlafaxine ER(150-225mg/d)

The above is a clinical trial inclusion criterion. Annotated with entity spans:
Current use of [Qualifier: standard] [Drug: antidepressant] treatment in [Qualifier: monotherapy] or combination of [Multiplier: 2] [Drug: antidepressants] : [Drug: escitalopram] ([Multiplier: 10 - 20mg/d]), [Drug: fluoxetine]([Multiplier: 20 - 40mg/d]), [Drug: paroxetine CR]([Multiplier: 25 - 50mg/d]), [Drug: sertraline]([Multiplier: 100 - 150mg/d]), [Drug: mirtazapine] ([Multiplier: 15 - 45mg/d]), [Drug: duloxetine] ([Multiplier: 30 - 60mg/d]) or [Drug: venlafaxine ER]([Multiplier: 150-225mg/d])